Clinical trial exclusion criterion:
Participant has a history of or current liver or renal insufficiency; significant cardiac, vascular, pulmonary, gastrointestinal, endocrine, neurologic, hematologic, rheumatologic, psychiatric, or metabolic disturbances

Annotated entities:
- Condition: "renal insufficiency"
- Condition: "liver insufficiency"
- Temporal: "history"
- Condition: "metabolic disturbances"
- Condition: "psychiatric disturbances"
- Condition: "rheumatologic disturbances"
- Condition: "hematologic disturbances"
- Condition: "neurologic disturbances"
- Condition: "endocrine disturbances"
- Condition: "gastrointestinal disturbances"
- Condition: "pulmonary disturbances"
- Condition: "vascular disturbances"
- Condition: "cardiac disturbances"
- Qualifier: "significant"
- Subjective_judgement: "significant"
- Undefined_semantics: "significant"